Clinical trial exclusion criterion:
5. Patient has contraindications to general anesthesia.

Entity relations:
- multi("contraindications to general anesthesia", "general anesthesia")